Clinical trial exclusion criterion:
5. Current use (any use in the past 4 weeks, chronic use within 6 past six months) of any investigational drug or of any medications with psychotropic, anti or pro-convulsive action.

Entity relations:
- Has_temporal("any use", "in the past 4 weeks")
- Has_temporal("chronic use", "within 6 past six months")
- multi("Current use", "Current use")
- Subsumes("Current use", "any use")
- Has_qualifier("medications", "psychotropic action")
- Has_qualifier("investigational drug", "Current use")
- OR("any use", "chronic use")
- OR("psychotropic action", "pro-convulsive action")
- OR("investigational drug", "medications")